Clinical trial inclusion criterion:
Must have had a treatment-free interval of greater than 6 months following response to platinum.

Entity relations:
- Has_index("greater than 6 months following response to platinum", "response to platinum")
- multi("response to platinum", "platinum")
- Has_temporal("a treatment-free interval", "greater than 6 months following response to platinum")